Clinical trial inclusion criterion:
ASA (American Society of Anesthesiologist) status 1-3 (27)

Annotated entities:
- Measurement: "ASA status"
- Measurement: "American Society of Anesthesiologist status"
- Value: "1-3"
- Value: "27"